Clinical trial inclusion criterion:
Routine blood test:WBC=3.0×109/L,Neutrophils=1.5×109/L,Hb=100g/L,Platelet=80×109/L; LVEF=50%;

Entity relations:
- Has_value("test:WBC", "=3.0×109/L")
- Has_value("Neutrophils", "=1.5×109/L")
- Has_value("Hb", "=100g/L")
- Has_value("Platelet", "=80×109/L")
- Has_value("LVEF", "=50%")